針對TNM Staging System Stage I、3 cm的早期肝細胞癌，以下的治療方式，何者不是「具治癒性可能（curative-intent）」的治療策略？
A. Surgical resection
B. Radiofrequency ablation
C. Sorafenib
D. Orthotopic liver transplantation

正確答案：C. Sorafenib